Clinical trial exclusion criterion:
Patient is mentally incapacitated and cannot consent or comply with follow-up.

Annotated entities:
- Post-eligibility: "Patient is mentally incapacitated and cannot consent or comply with follow-up"